有關Apgar score的敘述，下列何者正確？
A. Apgar score分數愈低表示嬰兒愈健康
B. 呼吸是嬰兒Apgar score的重要指標之一
C. 出生1分鐘時嬰兒的Apgar score比5分鐘的Apgar score更與預後有關
D. 母親使用硫酸鎂不會影響嬰兒Apgar score

正確答案：B. 呼吸是嬰兒Apgar score的重要指標之一